下列有關顱骨上的孔與穿過之結構之配對，何者錯誤？
A. 枕骨大孔（foramen magnum）：第十一對顱神經之脊髓根（spinal roots）
B. 視神經管（optic canal）：眼動脈（ophthalmic artery）
C. 卵圓孔（foramen ovale）：腦膜中動脈（middle meningeal artery）
D. 頸靜脈孔（jugular foramen）：第十一對顱神經

正確答案：C. 卵圓孔（foramen ovale）：腦膜中動脈（middle meningeal artery）